Clinical trial exclusion criterion:
Use of any prescription or over-the-counter medication, herbal medication, vitamins, or mineral supplements within 14 days prior to study drug administration (not including paracetamol). Medication for chronic use in age related disease will be allowed after approval by both the investigator and to the sponsor. No change in dose or regimen will be permitted during the study that is, from the Screening visit until the follow-up visit

Annotated entities:
- Drug: "any prescription"
- Undefined_semantics: "any prescription"
- Drug: "over-the-counter medication"
- Undefined_semantics: "over-the-counter medication"
- Drug: "herbal medication"
- Drug: "vitamins"
- Drug: "mineral supplements"
- Temporal: "within 14 days prior to study drug administration"
- Reference_point: "study drug administration"
- Drug: "paracetamol"
- Negation: "not"
- Drug: "Medication"
- Condition: "age related disease"
- Undefined_semantics: "age related disease"
- Multiplier: "chronic use"
- Undefined_semantics: "Medication"
- Grammar_Error: "will be allowed"
- Subjective_judgement: "approval by both the investigator and to the sponsor"
- Not_a_criteria: "No change in dose or regimen will be permitted during the study that is, from the Screening visit until the follow-up visit"